What does the Smith–Waterman algorithm do?

The Smith-Waterman algorithm performs local sequence alignments.